Clinical trial inclusion criteria:
Uncomplicated RYGB performed minimum 3 months prior to the study.
Fasting glucose < 7,0 mM, HbA1c < 48 mmol/mol 3 months after RYGB

Annotated entities:
- Qualifier: "Uncomplicated"
- Procedure: "RYGB"
- Temporal: "minimum 3 months prior to the study"
- Reference_point: "the study"
- Measurement: "Fasting glucose"
- Value: "< 7,0 mM"
- Measurement: "HbA1c"
- Value: "< 48 mmol/mol"
- Temporal: "3 months after RYGB"
- Reference_point: "RYGB"
- Procedure: "RYGB"